Clinical trial exclusion criterion:
Any confirmed or suspected immunosuppressive or immunodeficient condition, based on medical history and physical examination (no laboratory testing required).

Entity relations:
- Has_qualifier("immunosuppressive condition", "confirmed")
- OR("immunosuppressive condition", "immunodeficient condition")
- OR("confirmed", "suspected")